硬脂酸（stearic acid）完全氧化，須經過 beta-oxidation 途徑幾次？
A. 6
B. 7
C. 8
D. 9

正確答案：C. 8